Malignant illness requiring systemic chemotherapy in the last 6 months

The above is a clinical trial exclusion criterion. Annotated with entity spans:
[Condition: Malignant illness] requiring [Procedure: systemic chemotherapy] [Temporal: in the last 6 months]